NO se considera una intervención terciaria de prevención ante una situación de maltrato a la mujer :
1. Realizar una valoración periódica y sistemática de los indicadores de riesgo de maltrato.
2. Realizar una valoración integral física (lesiones producidas), psicológica (estado emocional) y social (redes sociales de apoyo).
3. Si existe riesgo vital inmediato habrá que realizar un traslado urgente al hospital o al juzgado de guardia.
4. Contactar e informar al pediatra si la mujer tiene hijos, tanto por el riesgo potencial (al ser testigos del maltrato) como por la posibilidad de ser víctimas del mismo.
5. Informar de los pasos legales.

Respuesta correcta: 1. Realizar una valoración periódica y sistemática de los indicadores de riesgo de maltrato.